Clinical trial exclusion criterion:
Previous exposure to drugs such as fingolimod, natalizumab, alemtuzumab, mitoxantrone and ocrelizumab.

Entity relations:
- Subsumes("drugs", "fingolimod")
- Has_temporal("drugs", "Previous")
- OR("fingolimod", "mitoxantrone", "alemtuzumab", "natalizumab", "ocrelizumab")